Un hombre de 30 años (caso índice) afecto de atrofia óptica de Leber presenta la mutación del genoma mitocondrial LHON11778A. En el consejo genético se le informará de los riesgos de transmisión de la enfermedad a su descendencia. ¿Qué información es la correcta?
1. El caso índice transmitirá la enfermedad a todos sus descendientes varones (herencia holándrica).
2. La enfermedad se transmitirá al 50% de los descendientes del caso índice, independientemente de su sexo.
3. La enfermedad se transmitirá a todos los descendientes del caso índice, por ser de herencia paterna.
4. La enfermedad se transmitirá a los descendientes de sexo femenino; pero a ningún varón.
5. La enfermedad no se transmitirá a los descendientes del caso índice, por ser de herencia materna.

Respuesta correcta: 5. La enfermedad no se transmitirá a los descendientes del caso índice, por ser de herencia materna.